Clinical trial inclusion criterion:
Patient with spontaneous intracranial hemorrhage or traumatic intracranial hemorrhage or patient requiring neurological surgery

Annotated entities:
- Condition: "spontaneous intracranial hemorrhage"
- Condition: "traumatic intracranial hemorrhage"
- Mood: "requiring"
- Procedure: "neurological surgery"